En el proceso de solubilización mediante formación de micelas:
1. El punto Kraft marca la transición entre la solubilidad de un tensioactivo iónico en forma de iones o en forma de micelas.
2. A concentraciones de tensioactivas inferiores a la Concentración Micelar Crítica (CMC) se forman otras estructuras que son cristales líquidos.
3. La medida de la intensidad de dispersión de la luz disminuye bruscamente a partir de la CMC.
4. El valor de la CMC varía mucho la temperatura ya que se trata fundamentalmente de un proceso entrópico.

Respuesta correcta: 1. El punto Kraft marca la transición entre la solubilidad de un tensioactivo iónico en forma de iones o en forma de micelas.